Patients scheduled to undergo revision total knee arthroplasty for infectious reasons.

The above is a clinical trial exclusion criterion. Annotated with entity spans:
Patients scheduled to undergo [Procedure: revision total knee arthroplasty] for [Condition: infectious reasons].